賴小姐因十二指腸潰瘍穿孔接受緊急手術，術後狀況良好。當住院醫師回顧賴小姐的病歷資料時，發現她在一年半前因上腹痛曾在本院接受胃鏡檢查，發現已患有十二指腸潰瘍及幽門桿菌陽性，但門診的醫師並未給予抗生素治療。下列何者為這名住院醫師對這件疑似醫療疏忽的事件下一步最合宜的處置？
A. 不追究既往而在賴小姐可口服藥物時直接給予治療幽門桿菌感染的藥物
B. 先去了解為何病歷上沒有記載使用抗生素治療幽門桿菌感染的紀錄
C. 向賴小姐坦承先前門診醫師的疏失及承諾為她向當事人及醫院求償
D. 寫報告給醫院首長告知此一醫療疏失並建請對相關人員懲處及教育

正確答案：B. 先去了解為何病歷上沒有記載使用抗生素治療幽門桿菌感染的紀錄